Clinical trial inclusion criterion:
Patient is 20 to 70 years of age

Annotated entities:
- Person: "age"
- Value: "20 to 70 years"